Clinical trial exclusion criterion:
Current unstable medical condition (e.g. unstable angina, myocardial infarction or coronary revascularization in the preceding 12 months, cardiac failure, chronic renal failure, chronic hepatic disease, severe pulmonary disease, blood disorders, poorly controlled diabetes, chronic infection)

Entity relations:
- multi("unstable medical condition", "unstable")
- Has_temporal("unstable medical condition", "Current")
- Has_temporal("coronary revascularization", "in the preceding 12 months")
- Has_temporal("myocardial infarction", "in the preceding 12 months")
- Has_qualifier("diabetes", "controlled")
- Has_negation("controlled", "poorly")
- multi("chronic infection", "chronic")
- Has_qualifier("pulmonary disease", "severe")
- multi("chronic hepatic disease", "chronic")
- multi("chronic renal failure", "chronic")
- Subsumes("unstable medical condition", "unstable angina")
- OR("unstable angina", "myocardial infarction", "cardiac failure", "chronic renal failure", "chronic hepatic disease", "pulmonary disease", "blood disorders", "diabetes", "chronic infection", "coronary revascularization")